List some substances important for proper nervous system function that gut microbes produce.

serotonin
gamma-aminobutyric acid
short-chain fatty acids
neurotransmitters